Clinical trial exclusion criterion:
Participation in other interventional research.

Annotated entities:
- Non-query-able: "Participation in other interventional research."